Patients with high intracranial pressure.

The above is a clinical trial exclusion criterion. Annotated with entity spans:
Patients with [Value: high] [Measurement: intracranial pressure].